Entre los factores de tensión por la hospitalización en los escolares (niños 6-12 años), NO se encuentra:
1. Pérdida de control.
2. Miedo a la oscuridad.
3. Lesión corporal.
4. Falta de intimidad.

Respuesta correcta: 2. Miedo a la oscuridad.